Clinical trial exclusion criterion:
Habitual bedtimes after 3 AM, habitual rise times after 10 AM, or habitual napping > 1hour/day;

Annotated entities:
- Non-query-able: "Habitual bedtimes after 3 AM, habitual rise times after 10 AM, or habitual napping > 1hour/day"